Clinical trial exclusion criterion:
7. anticoagulation or immunosuppressive therapy

Entity relations:
- OR("anticoagulation therapy", "immunosuppressive therapy")